¿Cuál de las siguientes infecciones víricas se asocia con el desarrollo de la púrpura fulminante en el neonato?:
1. Citomegalovirus.
2. Hepatitis B.
3. Varicela-Zoster.
4. Sarampión.

Respuesta correcta: 3. Varicela-Zoster.